測量一群兒童的血中鉛濃度（blood lead level, 單位µg/dl）與尿中古丁尼濃度（cotinine level, 單位ng/ml）的資料，今欲比較血中鉛濃度與尿中古丁尼濃度何者變異較大，下列何種統計量最合適？
A. 標準差（standard deviation）
B. 變異數（variance）
C. 變異係數（coefficient of variation）
D. 全距（range）

正確答案：C. 變異係數（coefficient of variation）